H pylori infection failed after at least two eradication therapies

The above is a clinical trial inclusion criterion. Annotated with entity spans:
[Condition: H pylori infection] [Qualifier: failed] after [Multiplier: at least two] [Procedure: eradication therapies]